下列何者不包括在基本日常生活自理（activity of daily living，ADL）的項目？
A. 如廁
B. 煮飯
C. 穿脫衣服
D. 洗澡

正確答案：B. 煮飯